Clinical trial inclusion criterion:
Patient has attempted physical therapy and corticosteroid injections with local anesthetic -Previous injections of lidocaine and corticosteroid provided at least minor immediate relief

Annotated entities:
- Procedure: "physical therapy"
- Procedure: "corticosteroid injections"
- Drug: "ocal anesthetic"
- Non-representable: "-Previous injections of lidocaine and corticosteroid provided at least minor immediate relief"